當懷疑病人有下肢周邊血管阻塞疾病時，可觸摸檢查以下血管脈搏，何者例外？
A. 膕動脈（popliteal artery）
B. 脛後動脈（posterior tibial artery）
C. 腓動脈（fibular artery）
D. 足背動脈（pedis dorsalis artery）

正確答案：C. 腓動脈（fibular artery）